人體中biotin缺乏時，下列那個生化反應會受影響而無法進行？
A. 轉氨基反應（transamination）
B. 磷酸化反應（phosphorylation）
C. 羧化反應（carboxylation）
D. 甲基化反應（methylation）

正確答案：C. 羧化反應（carboxylation）